Clinical trial inclusion criterion:
Body mass index (BMI) less than or equal to 32

Annotated entities:
- Measurement: "Body mass index (BMI)"
- Value: "less than or equal to 32"